有關大骨盆（greater pelvis）的敘述，下列何者正確？
A. 位於骨盆入口（pelvic inlet）下方
B. 男性較女性寬且淺
C. 內含乙狀結腸（sigmoid colon）
D. 內含腎臟（kidney）

正確答案：C. 內含乙狀結腸（sigmoid colon）